3. History of menstrual events that occur in regular cycles

The above is a clinical trial inclusion criterion. Annotated with entity spans:
[Parsing_Error: 3.] [Temporal: History] of [Condition: menstrual events that occur in regular cycles]